Clinical trial exclusion criterion:
Patients on neuroleptic drugs in the two months prior to study entry or cognitive behavioural therapy specific to OCD within four weeks of study entry

Annotated entities:
- Drug: "neuroleptic drugs"
- Temporal: "in the two months prior to study entry"
- Reference_point: "study entry"
- Procedure: "cognitive behavioural therapy"
- Condition: "OCD"
- Temporal: "within four weeks of study entry"
- Reference_point: "study entry"